What is the H4S47C cleavage mapping method used for?

H4S47C-anchored cleavage mapping reveals the precise position of histone H4 in every nucleosome in the genome.